40歲女性，月亮臉，長青春痘，有水牛肩。抽血發現早上八點ACTH < 5.0 pg/mL，cortisol 22.6 µg/dL，下午四點ACTH < 5.0 pg/mL，cortisol 24.6 µg/dL，晚上11點口服1 mg之dexamethasone，隔天早上八點之 cortisol 20.0 µg/dL。則下列何者正確？
A. 進一步可做腎上腺電腦斷層攝影
B. 此病人之診斷為Cushing's disease
C. 手術後不用服用cortisone acetate
D. 這病人顯然長期在使用dexamethasone

正確答案：A. 進一步可做腎上腺電腦斷層攝影